Clinical trial inclusion criterion:
Histologically confirmed locally advanced gastric (primary endpoint includes proximal and mid-body stomach) or esophagogastric adenocarcinoma; distal gastric (antral) adenocarcinomas are eligible for enrolment but will not be included in the primary analysis

Entity relations:
- Has_qualifier("esophagogastric adenocarcinoma", "locally advanced")
- Has_qualifier("adenocarcinoma gastric", "proximal stomach")
- Subsumes("distal gastric", "antral")
- Has_qualifier("adenocarcinomas", "distal gastric")
- OR("esophagogastric adenocarcinoma", "adenocarcinoma gastric")
- OR("proximal stomach", "mid-body stomach")
- OR("esophagogastric adenocarcinoma", "adenocarcinomas")